Considered for a standard immunosuppressive protocol.

The above is a clinical trial inclusion criterion. Annotated with entity spans:
[Mood: Considered for] a [Procedure: standard immunosuppressive protocol].